Clinical trial exclusion criteria:
Congestive heart failure, history of ventricular tachycardia, ventricular fibrillation or multifocal ventricular extrasystoles or QTc prolongation.
Patients with atrial fibrillation taking any anticoagulant therapy or patients with a history of cardioembolic ischemic stroke or hemorrhagic stroke.
Patients with a history (= 12 months) of acute coronary syndrome receiving dual antiplatelet therapy, or patients receiving monotherapy with aspirin.
Patients with hepatic impairment (child-Pugh staging, calibration = 5) or renal impairment (creatinine clearance = 30ml / min), recent peptic ulcer, a history of hypersensitivity to cilostazol, cancer patients undergoing treatment.

Annotated entities:
- Condition: "Congestive heart failure"
- Condition: "ventricular tachycardia"
- Temporal: "history of"
- Condition: "ventricular fibrillation"
- Condition: "multifocal ventricular extrasystoles"
- Condition: "QTc prolongation"
- Condition: "atrial fibrillation"
- Procedure: "anticoagulant therapy"
- Temporal: "history of"
- Condition: "ischemic stroke"
- Qualifier: "cardioembolic"
- Condition: "hemorrhagic stroke"
- Temporal: "history"
- Temporal: "= 12 months"
- Condition: "acute coronary syndrome"
- Procedure: "dual antiplatelet therapy"
- Procedure: "monotherapy"
- Drug: "aspirin"
- Condition: "hepatic impairment"
- Measurement: "child-Pugh staging"
- Value: "calibration = 5"
- Condition: "renal impairment"
- Measurement: "creatinine clearance"
- Value: "= 30ml / min"
- Temporal: "recent"
- Condition: "peptic ulcer"
- Temporal: "history of"
- Condition: "hypersensitivity"
- Drug: "cilostazol"
- Condition: "cancer"
- Procedure: "treatment"